Subject has a reversible causes for AF like hyperthyroidism and alcoholism.

The above is a clinical trial exclusion criterion. Annotated with entity spans:
Subject has a reversible causes for AF like [Condition: hyperthyroidism] and [Condition: alcoholism].